Clinical trial exclusion criterion:
Have participated in an interventional, medical, surgical, or pharmaceutical study within 30 days of screening.

Annotated entities:
- Observation: "interventional study"
- Observation: "medical study"
- Observation: "surgical study"
- Observation: "pharmaceutical study"
- Temporal: "within 30 days of screening"
- Reference_point: "screening"